No está incluido entre los lípidos que se encuentran en las membranas biológicas:
1. Isopentenil pirofosfato.
2. Fosfatidilinositol.
3. Esfingomielina.
4. Ácido fosfatídico.
5. Fosfatidiletanolamina.

Respuesta correcta: 1. Isopentenil pirofosfato.